安排病人接受白內障手術前，需要跟病人詳細說明手術的內容及其效益與風險，並在確認病人瞭解及同意後，再請病人簽署手術知情同意書（informed consent），這種作法最主要是在確保：
A. 病人自主
B. 病人隱私
C. 資源浪費
D. 公平正義

正確答案：A. 病人自主